Clinical trial exclusion criterion:
Current or history of suicidal ideation

Annotated entities:
- Condition: "suicidal ideation"
- Temporal: "Current"
- Temporal: "history"